依照 Enzyme Commission（EC）建議之酵素命名原則，催化下述反應「glucose + ATP → glucose-6-phosphate  + ADP」的酵素應歸屬於下列何種酵素類別？
A. hydrolase
B. ligase
C. oxidoreductase
D. transferase

正確答案：D. transferase